Clinical trial inclusion criterion:
Taking an NNRTI or integrase containing regimen with prior exposure to PI greater than 2 weeks. It must be clearly stated in the source document that PI was switched to another agent for convenience.

Entity relations:
- AND("regimen", "NNRTI")
- Has_temporal("PI", "prior")
- Has_temporal("PI", "greater than 2 weeks")
- OR("NNRTI", "integrase")